Clinical trial inclusion criterion:
7. Are taking megestrol acetate and continue to lose weight despite at least 2 weeks of therapy.

Annotated entities:
- Drug: "megestrol acetate"
- Observation: "lose weight"
- Temporal: "continue"
- Temporal: "at least 2 weeks"
- Procedure: "therapy"
- Temporal: "Are taking"